Clinical trial inclusion criterion:
Diagnosed with TB by criteria per Brazilian Ministry of Health

Entity relations:
- Has_qualifier("TB", "criteria per Brazilian Ministry of Health")